Las microvellosidades contienen en su interior un haz de:
1. Microtúbulos.
2. Filamentos de actina.
3. Filamentos intermedios.
4. Espectrina.
5. Fibras de colágeno.

Respuesta correcta: 2. Filamentos de actina.